25 歲男性突發高燒（39.2℃），咳嗽多痰，呼吸困難而就醫，無胸痛，亦不吸菸。胸部 X 光片呈右上肺葉肺炎。下列敘述何者最不適當？
A. 最常見的致病菌為 Streptococcus pneumoniae
B. 應立即檢驗白血球及痰液染色（Gram's stain）
C. 應根據臨床資料及經驗，先投與適當抗生素
D. 應立即安排胸腔電腦斷層掃描及支氣管鏡檢查

正確答案：D. 應立即安排胸腔電腦斷層掃描及支氣管鏡檢查